(2) Body mass index (BMI):20-29.

The above is a clinical trial inclusion criterion. Annotated with entity spans:
(2) [Measurement: Body mass index] ([Measurement: BMI]):[Value: 20-29].